Cystolithiasis within the past 3 months

The above is a clinical trial exclusion criterion. Annotated with entity spans:
[Condition: Cystolithiasis] [Temporal: within the past 3 months]